下列何者穿過旋後肌（supinator）？
A. 橈神經的深支（deep branch of radial nerve）
B. 橈神經的淺支（superficial branch of radial nerve）
C. 尺神經的深支（deep branch of ulnar nerve）
D. 尺神經的淺支（superficial branch of ulnar nerve）

正確答案：A. 橈神經的深支（deep branch of radial nerve）